Clinical trial inclusion criterion:
No previous use of vitamin D.

Entity relations:
- Has_temporal("vitamin D", "previous")
- Has_negation("vitamin D", "No")